Clinical trial exclusion criterion:
Patients with chronic kidney disease stage with eGFR < 30 ml/min (CKD stage IV and V)

Annotated entities:
- Condition: "chronic kidney disease"
- Measurement: "eGFR"
- Value: "< 30 ml/min"
- Condition: "CKD"
- Qualifier: "stage IV"
- Qualifier: "stage V"